對於氣喘治療之敘述，下列何者錯誤？
A. 吸入支氣管擴張劑，比口服用藥較少副作用
B. 茶鹼（theophylline）之支氣管擴張作用，比刺激交感神經的支氣管擴張效果要強
C. 類固醇是最有效且最強的抗炎藥物
D. 吸入抗副交感支氣管擴張劑，是副作用最少，但作用較慢之支氣管擴張藥物

正確答案：B. 茶鹼（theophylline）之支氣管擴張作用，比刺激交感神經的支氣管擴張效果要強